Clinical trial inclusion criterion:
Bilirubin/ SGOT/SGPT < 5 × upper normal limits.

Entity relations:
- Has_value("SGPT", "< 5 × upper normal limits")
- Has_value("SGOT", "< 5 × upper normal limits")
- Has_value("Bilirubin", "< 5 × upper normal limits")